Clinical trial exclusion criteria:
Partial mole
History of treatment for molar pregnancy like prior evacuation or chemotherapy
Women requiring hysterectomy for treatment of H Mole

Annotated entities:
- Condition: "Partial mole"
- Condition: "molar pregnancy"
- Procedure: "treatment"
- Procedure: "evacuation"
- Procedure: "chemotherapy"
- Person: "Women"
- Procedure: "hysterectomy"
- Condition: "H Mole"